下列何者是女性青春期表徵的出現順序（先→後）？
A. 乳房突出→陰毛→身高快速增加→初潮
B. 陰毛→乳房突出→初潮→身高快速增加
C. 乳房突出→初潮→陰毛→身高快速增加
D. 初潮→乳房突出→陰毛→身高快速增加

正確答案：A. 乳房突出→陰毛→身高快速增加→初潮